Clinical trial exclusion criterion:
2. Are pregnant

Annotated entities:
- Condition: "pregnant"